碘與酪胺酸（tyrosine）的結合主要是靠：
A. 甲狀腺過氧化（peroxidase）
B. 甲狀腺蛋白（protease）
C. 甲狀腺脫碘（deiodinase）
D. 甲狀腺脫氫（dehydrogenase）

正確答案：A. 甲狀腺過氧化（peroxidase）